Clinical trial inclusion criterion:
The patients present with operable unilateral invasive breast cancers without distant metastasis(stage I, II, and III)

Entity relations:
- Has_negation("distant metastasis", "without")
- Has_value("stage", "I, II, and III")
- Subsumes("distant metastasis", "stage")
- Has_qualifier("breast cancers", "invasive")
- Has_qualifier("breast cancers", "unilateral")
- Has_qualifier("breast cancers", "operable")
- AND("breast cancers", "distant metastasis")